Cardiac or peripheral arterial disease

The above is a clinical trial exclusion criterion. Annotated with entity spans:
Cardiac or [Condition: peripheral arterial disease]